Clinical trial exclusion criterion:
Known to be sero-positive for human immunodeficiency virus (HIV), hepatitis C virus (HCV), or hepatitis B virus (HBV)

Annotated entities:
- Value: "sero-positive"
- Measurement: "human immunodeficiency virus (HIV)"
- Condition: "sero-positive for human immunodeficiency virus (HIV)"
- Condition: "sero-positive for hepatitis C virus (HCV)"
- Condition: "sero-positive for hepatitis B virus (HBV)"
- Measurement: "hepatitis C virus (HCV)"
- Measurement: "hepatitis B virus (HBV)"